Hospitalization for myocardial infarction or cardiac surgery within previous 90 days

The above is a clinical trial exclusion criterion. Annotated with entity spans:
[Observation: Hospitalization] for [Condition: myocardial infarction] or [Procedure: cardiac surgery] [Temporal: within previous 90 days]